Clinical trial exclusion criterion:
Allergy to acetaminophen

Entity relations:
- AND("Allergy", "acetaminophen")